Patients with previous permanent upper face fillers injection

The above is a clinical trial exclusion criterion. Annotated with entity spans:
Patients with previous [Procedure: permanent] [Qualifier: upper face] fillers injection